頭部外傷造成的diffuse axonal injury（DAI），下列敘述何者錯誤？
A. 病人通常沒有清明期（lucid interval）
B. 電腦斷層掃描（brain CT）上可能沒有明顯的病灶，但病人卻呈昏迷狀態
C. 如果病人不幸死亡，解剖上腦部有明顯不正常的外觀
D. 在胼胝體（corpus callosum）可見出血性壞死的病灶

正確答案：C. 如果病人不幸死亡，解剖上腦部有明顯不正常的外觀